Clinical trial inclusion criterion:
Be categorized as American Society of Anesthesiologists (ASA) Physical Status Class 1, 2, or 3.

Entity relations:
- Has_value("American Society of Anesthesiologists (ASA) Physical Status Class", "1")
- OR("1", "2", "3")